制黴菌素（Nystatin）之作用機轉，與下列何種藥物一樣？
A. 氟胞嘧啶（Flucytosine）
B. 兩性黴素（Amphotericin B）
C. 卡泊芬淨（Caspofungin）
D. 糞殼菌素（Sordarin）

正確答案：B. 兩性黴素（Amphotericin B）